有關抗利尿激素分泌不當症候群（syndrome of inappropriate secretion of ADH）的敘述，下列何者錯誤？
A. 診斷必須排除腎上腺或甲狀腺功能不足
B. 通常是某些疾病的併發症，如肺結核、肺癌等
C. 病人出現低鈉血症，是由於體液過多所致
D. 病人的尿液鈉濃度通常大於 10 mmol/L，且滲透壓大於 100 mOsm/kgH2O

正確答案：C. 病人出現低鈉血症，是由於體液過多所致